Patients who had received surgical periodontal treatment within the past 12 months

The above is a clinical trial exclusion criterion. Annotated with entity spans:
Patients who had received [Procedure: surgical periodontal treatment] [Temporal: within the past 12 months]